一位77歲婦人，晚間10點入睡時正常，但一早8點醒來右側肢體無力、口齒不清，早上10點即被家人送到急診，經神經學及影像學檢查，研判為左側放射冠梗塞（corona radiata infarction），以下何者是對婦人最適當的急性中風治療？
A. 靜脈血栓溶解（IV tPA）
B. 裝置頸動脈支架（stenting）
C. 抗血小板藥物（antiplatelet）
D. 抗凝血藥物（anticoagulants）

正確答案：C. 抗血小板藥物（antiplatelet）